Clinical trial exclusion criterion:
Treatment with class I or III antiarrhythmic drugs

Annotated entities:
- Qualifier: "class I"
- Qualifier: "class III"
- Drug: "antiarrhythmic drugs"